對一位C5～C6完全性脊髓損傷導致逼尿肌尿道外括約肌共濟失調（detrusor sphincter dyssynergia，DSD）的病人，下列何種處置不合適？
A. 間歇性導尿以定時排空膀胱
B. 口服抗膽鹼藥物以降低膀胱內壓
C. 當測得漏尿壓力為20 cmH2O時，可以進行尿道外括約肌切開術（sphincterotomy）以保護腎臟
D. 置放尿道支架（urethral stent）以方便排空膀胱

正確答案：C. 當測得漏尿壓力為20 cmH2O時，可以進行尿道外括約肌切開術（sphincterotomy）以保護腎臟